Clinical trial exclusion criterion:
Patient refusal to participate in the study

Annotated entities:
- Informed_consent: "Patient refusal to participate in the study"